Clinical trial exclusion criterion:
History of sensitivity to any of the study medications, or components thereof or a history of drug or other allergy that, in the opinion of the investigator or GSK Medical Monitor, contraindicates their participation.

Entity relations:
- OR("sensitivity to any of the study medications", "allergy", "drug allergy")